Clinical trial exclusion criterion:
Antibiotic use except study drugs

Annotated entities:
- Drug: "Antibiotic"
- Negation: "except"
- Drug: "study drugs"